Patients with any panel reactive antibody (PRA) equal to or above 50%, class I or class II;

The above is a clinical trial exclusion criterion. Annotated with entity spans:
Patients with any [Measurement: panel reactive antibody] ([Measurement: PRA]) [Value: equal to or above 50%], [Value: class I] or [Value: class II];